Pridopidine has been tested for treatment of which disorder?

Pridopidine is a dopaminergic stabilizer that has shown promising results for treatment of Huntington disease patients.